Which siRNA based drug is in clinical trials for the treatment of pancreatic cancer?

siG12D-LODERTM has been tested in a phase 1/2a clinical trial of patients with pancreatic cancer.